What is the mechanism of action of motolimod?

Motolimod is the toll-like receptor 8 (TLR8) agonist that stimulates innate and adaptive immunity.